Clinical trial exclusion criterion:
History of allergies to phenol, any of the antibiotics listed in the vaccine content, or any other component of ACAM2000 or its diluents.

Entity relations:
- multi("listed in the vaccine content", "vaccine")
- Has_qualifier("antibiotics", "listed in the vaccine content")
- AND("allergies", "phenol")
- OR("phenol", "antibiotics", "ACAM2000 diluents", "ACAM2000")